Clinical trial inclusion criterion:
Serum Cr = 1 × ULN endogenous creatinine clearance>50ml/min (Cockcroft-Gault formula)

Entity relations:
- Has_value("Serum Cr", "= 1 × ULN")
- Has_value("endogenous creatinine clearance", ">50ml/min")
- OR("Serum Cr", "endogenous creatinine clearance")